一位 6 歲男孩，主訴發燒、喉嚨痛 2 天、無明顯流鼻水，身體理學檢查喉嚨充血，扁桃腺有白色滲出物，淋巴結稍腫。下列何種狀況需要完整抗生素療程治療？
A. A 群鏈球菌感染（Group A streptococcal infection）
B. 手足口症（Hand-Foot-Mouth disease）
C. 腺病毒感染（Adenoviral infection）
D. 川崎症（Kawasaki disease）

正確答案：A. A 群鏈球菌感染（Group A streptococcal infection）